一位有多位性伴侶之少女在陰道出現潰瘍性瘡傷，並有發癢、疼痛、排尿困難及全身性症狀，並持續發燒 10 天左右，Papanicolaou（Pap）抹片檢查顯示多核巨大細胞（syncytia）及 Cowdry A 型包涵體，此少女之病徵是由何病毒感染所引起的？
A. 單純疹病毒（Herpes simplex virus）
B. 人類乳突病毒（HPV）
C. 細小病毒 B19（Parvovirus B19）
D. 德國麻疹病毒（Rubella virus）

正確答案：A. 單純疹病毒（Herpes simplex virus）